In the use of antibiotics and anti-inflammatories in the last three months;

The above is a clinical trial exclusion criterion. Annotated with entity spans:
In the use of [Drug: antibiotics] and [Drug: anti-inflammatories] [Temporal: in the last three months];